¿Cuál de las siguientes afirmaciones es correcta?:
1. Una de las reacciones adversas frecuentes de los Fármacos Opiáceos es la aparición de diarrea.
2. La combinación de Opiáceos menores y Antiinflamatorios No Esteroideos (AINES) solo está indicada en el tratamiento del dolor muy intenso.
3. En mayor o menor medida, todos los Antiinflamatorios No Esteroideos (AINES) poseen efecto antitérmico, analgésico y antiinflamatorio.
4. La Aspirina potencia la agregación plaquetaria.

Respuesta correcta: 3. En mayor o menor medida, todos los Antiinflamatorios No Esteroideos (AINES) poseen efecto antitérmico, analgésico y antiinflamatorio.